Which particular intersex phenotype is related to steroid reductase?

Mutations in the steroid 5 alpha-reductase 2 gene are the cause of 5 alpha reductase deficiency. In the 20 yr since it was established that impairment of dihydrotestosterone formation is a cause of a rare form of human intersex, a wealth of information has accumulated about the genetics, endocrinology, and variable phenotypic manifestations.